一個50歲臺灣男性病人患有單側右耳積液性中耳炎，合併右側上頸部4公分大無痛性淋巴結腫大，須高度懷疑可能有下列那一種癌症？
A. 喉癌
B. 下咽癌
C. 鼻咽癌
D. 腮腺癌

正確答案：C. 鼻咽癌